Clinical trial exclusion criterion:
Coagulopathies (INR > 2, activated partial thromboplastin time - aPTT>44 sec);

Entity relations:
- Has_value("INR", "> 2")
- Has_value("activated partial thromboplastin time - aPTT", ">44 sec")
- Subsumes("Coagulopathies", "INR")
- OR("INR", "activated partial thromboplastin time - aPTT")